Clinical trial inclusion criterion:
Karnofsky Performance Status > 60

Entity relations:
- Has_value("Karnofsky Performance Status", "> 60")